Clinical trial exclusion criterion:
Augmentation of labor (latent or active phase)

Entity relations:
- Has_qualifier("Augmentation of labor", "latent phase")
- OR("latent phase", "active phase")